Un test que permite comparar dos muestras independientes cuando la variable se distribuye normalmente y las muestras tienen homogeneidad de varianza es:
1. t de Student con n1+n2 grados de libertad.
2. t de Student con (n1+n2)-1 grados de libertad.
3. t de Student con (n1+n2)-2 grados de libertad.
4. Welch.

Respuesta correcta: 3. t de Student con (n1+n2)-2 grados de libertad.